Clinical trial exclusion criterion:
Vegetarians, vegans or patients with religious dietary restrictions (as the standard meal contains meat)

Annotated entities:
- Person: "Vegetarians"